Clinical trial inclusion criterion:
Scheduled for arthroscopic labral repair with or without osteoplasty of the hip.

Annotated entities:
- Procedure: "arthroscopic labral repair"
- Procedure: "osteoplasty"
- Qualifier: "hip"
- Mood: "Scheduled"